Clinical trial exclusion criterion:
Underlying chronic liver disease (hemochromatosis, liver cell carcinoma, autoimmune liver disease, liver cirrhosis, chronic viral hepatitis)

Entity relations:
- Subsumes("chronic liver disease", "hemochromatosis")
- OR("hemochromatosis", "liver cirrhosis", "autoimmune liver disease", "liver cell carcinoma", "chronic viral hepatitis")